Clinical trial inclusion criterion:
HB = 90g / L

Entity relations:
- Has_value("HB", "= 90g / L")